下列有關嗎啡類物質之藥理作用描述，何者錯誤？
A. Naloxone 口服吸收的效果較 naltrexone 佳
B. Methadone 所產生的禁斷現象較 morphine 弱
C. Codeine 產生止咳作用所需的劑量較止痛所需的劑量低
D. Morphine 的止痛作用較 codeine 強

正確答案：A. Naloxone 口服吸收的效果較 naltrexone 佳